Clinical trial exclusion criterion:
Patient who are unwilling to participate

Annotated entities:
- Observation: "unwilling to participate"